Clinical trial inclusion criterion:
Treatment with stable doses of angiotensin-converting enzyme inhibitors, angiotensin II receptor blockers or anti-aldosterone agents in the last four weeks.

Entity relations:
- Has_multiplier("angiotensin-converting enzyme inhibitors", "stable doses")
- Has_temporal("angiotensin-converting enzyme inhibitors", "in the last four weeks")
- OR("angiotensin-converting enzyme inhibitors", "angiotensin II receptor blockers", "anti-aldosterone agents")